Clinical trial exclusion criteria:
Established pre-existing diabetes (including unrecognised diabetes defined as a fasting plasma glucose = 7.0mmol/L and/ or HbA1c = 48mmol/mol); Contraindications to metformin therapy (creatinine = 130µmol/L/ alanine transaminase = 2.0 x upper limit normal/ previous intolerance to metformin)
Planned continued antenatal care/ delivery at centre not included in trial
Planned fast for cultural/ religious reasons e.g. Ramadan

Annotated entities:
- Condition: "diabetes"
- Measurement: "fasting plasma glucose"
- Value: "= 7.0mmol/L"
- Measurement: "HbA1c"
- Value: "= 48mmol/mol)"
- Condition: "Contraindications"
- Drug: "metformin"
- Measurement: "creatinine"
- Value: "= 130µmol/L/"
- Measurement: "alanine transaminase"
- Value: "= 2.0 x upper limit normal"
- Condition: "intolerance"
- Drug: "metformin"
- Competing_trial: "Planned continued antenatal care/ delivery at centre not included in trial"
- Non-query-able: "Planned fast for cultural/ religious reasons e.g. Ramadan"